Clinical trial inclusion criterion:
Age 18 or older

Entity relations:
- Has_value("Age", "18 or older")